Clinical trial inclusion criterion:
Provide signed and dated informed consent form.

Annotated entities:
- Non-query-able: "Provide signed and dated informed consent form."